下列之皮膚表現那一項不是皮肌炎（dermatomyositis）之典型特徵？
A. Gottron's sign
B. Shawl sign
C. Heliotrope rash
D. Erythema marginatum

正確答案：D. Erythema marginatum